15 歲女性，50 公斤，152 公分，接受眼睛斜視矯正手術。麻醉誘導時，給予fentanyl 100 μg及thiopental 200 mg，在succinylcholine 60 mg的幫助下插管，麻醉以吸入性麻醉劑isoflurane維持；當手術進行至一小時，發現病患血壓升高，心跳變快，end-tidal CO2升高，量得體溫是 39.8℃，且持續緩慢上升中 。下列敘述何者錯誤？
A. 病患可能發生惡性高熱症（malignant hyperthermia）
B. 此時應停止所有吸入性麻醉劑，並給予純氧呼吸
C. 可給予 calcium channel blocker，以降低血壓
D. 應迅速施予降溫作為，並給予 dantrolene 治療

正確答案：C. 可給予 calcium channel blocker，以降低血壓